Clinical trial inclusion criterion:
No contraindication to chemoradiotherapy.

Entity relations:
- Has_negation("contraindication", "No")
- AND("contraindication", "chemoradiotherapy")